Clinical trial inclusion criterion:
For healthy individuals: Healthy, without allergies and with the age of 18 years or above.

Entity relations:
- Has_value("age", "18 years or above")
- Has_negation("allergies", "without")
- AND("healthy", "Healthy")
- AND("healthy", "allergies")
- AND("healthy", "age")